Clinical trial exclusion criterion:
being treated with a beta-blocker

Annotated entities:
- Drug: "beta-blocker"
- Procedure: "treated"